Las mutaciones del gen RAI1 (gen inducido por ácido retinoico) se asocian al síndrome de:
1. Sotos.
2. Marfan.
3. Smith-Magenis.
4. Rett.

Respuesta correcta: 3. Smith-Magenis.